severe valve disease requiring valve replacement

The above is a clinical trial exclusion criterion. Annotated with entity spans:
[Qualifier: severe] [Condition: valve disease] [Qualifier: requiring valve replacement]